La reacción de 3-nitrobenzaldehído con NaBH4 en metanol acuoso da:
1. 3-Aminobenzaldehído.
2. Ácido 3-nitrobenzoico.
3. 1-Metil-3-nitrobenceno.
4. 3-Nitrobenzoato de sodio.
5. (3-Nitrofenil)metanol.

Respuesta correcta: 5. (3-Nitrofenil)metanol.